Clinical trial exclusion criterion:
Clinically significant systemic disease (such as diabetes, metabolic syndrome, immunological diseases, diagnosed thrombophilia, porphyria, or any other medical condition requiring the use of low-molecular weight heparin therapy)

Annotated entities:
- Condition: "systemic disease"
- Qualifier: "Clinically significant"
- Condition: "diabetes"
- Condition: "metabolic syndrome"
- Condition: "immunological diseases"
- Condition: "diagnosed thrombophilia"
- Condition: "porphyria"
- Condition: "medical condition"
- Drug: "low-molecular weight heparin"